下列何種構造之主成分不是由膠原組織（collagenous tissues）組成？
A. 動脈瓣（aortic valves）
B. 中型靜脈瓣膜（valves of medium-sized vein）
C. 腱索（chordae tendineae）
D. 蒲金氏纖維（Purkinje fibers）

正確答案：D. 蒲金氏纖維（Purkinje fibers）